Clinical trial exclusion criterion:
Patients posing a serious suicidal risk and/or violence as judged by the investigator;

Entity relations:
- OR("suicidal risk", "violence")